history of psychiatric illness

The above is a clinical trial exclusion criterion. Annotated with entity spans:
[Temporal: history] of [Condition: psychiatric illness]